Clinical trial exclusion criterion:
11. History of severe allergic reactions to any unknown allergens or components of the study drugs.

Entity relations:
- Has_qualifier("allergic reactions", "severe")
- AND("allergic reactions", "to any unknown allergens or components of the study drugs")
- Has_temporal("allergic reactions", "History")